Have used drugs for weight loss within 1 month of screening.

The above is a clinical trial exclusion criterion. Annotated with entity spans:
Have used [Drug: drugs for weight loss] [Temporal: within 1 month of screening].